Clinical trial inclusion criterion:
Patient hospitalized in neuro-critical care for:

Annotated entities:
- Visit: "hospitalized"
- Visit: "neuro-critical care"